胎盤早期剝離（placental abruption）潛在較常見的合併症是下列何者？
A. 子宮內翻
B. 凝血障礙
C. 產褥感染
D. 子宮乏力

正確答案：B. 凝血障礙